Clinical trial exclusion criterion:
Previous history of ovarian surgery or surgical removal of one ovary.

Entity relations:
- Has_qualifier("surgical removal", "ovary")
- Has_multiplier("ovary", "one")
- OR("ovarian surgery", "surgical removal")